人類個體受到人類免疫缺損病毒（HIV）攻擊後會導致免疫功能下降，造成次發免疫功能缺損（後天性免疫缺乏症候群，通稱 AIDS）。AIDS 病患經常發現的皮膚癌 Kaposi 肉瘤，其直接成因為何？
A. Kaposi 肉瘤疱疹病毒
B. 人類疱疹病毒第一型（HHV-1）
C. 免疫球蛋白血中濃度太低
D. 皮膚中 B 型肝炎病毒蛋白質堆積

正確答案：A. Kaposi 肉瘤疱疹病毒